Severe renal failure with estimated glomerular filtration rate <30 ml/min

The above is a clinical trial exclusion criterion. Annotated with entity spans:
[Qualifier: Severe] [Condition: renal failure] with [Measurement: estimated glomerular filtration rate] [Value: <30 ml/min]